下列那一種由腦下腺分泌（secretion）的荷爾蒙是在下視丘合成（synthesis）？
A. 泌乳素（prolactin）
B. 濾泡促素（FSH）
C. 生長素（growth hormone）
D. 催產素（oxytocin）

正確答案：D. 催產素（oxytocin）